Clinical trial inclusion criterion:
The control group will be matched by the following parameters: age, skin color and type, and indication for peeling, and will be picked up by the dermatologist.

Annotated entities:
- Observation: "control group"
- Person: "age"
- Person: "skin color"
- Person: "type"